Two or more relapses in the previous year, whether on DMD treatment or not.

The above is a clinical trial inclusion criterion. Annotated with entity spans:
[Multiplier: Two or more] [Condition: relapses] [Temporal: in the previous year], whether on DMD treatment or not.